Clinical trial inclusion criterion:
Has a diagnosis of major depressive disorder by Diagnostic and Statistical Manual of Mental Disorders, Fourth Edition (DSM-IV) criteria.

Entity relations:
- Has_qualifier("major depressive disorder", "Diagnostic and Statistical Manual of Mental Disorders, Fourth Edition (DSM-IV) criteria")